Cyclosporine; St. John's Wort; Efavirenz; Phenytoin; Carbamazepine; Bosentan; HIV protease inhibitors; modafinil; ketoconazole; or rifampin use within 7 days of enrollment

The above is a clinical trial exclusion criterion. Annotated with entity spans:
[Drug: Cyclosporine]; [Drug: St. John's Wort]; [Drug: Efavirenz]; [Drug: Phenytoin]; [Drug: Carbamazepine]; [Drug: Bosentan]; [Drug: HIV protease inhibitors]; [Drug: modafinil]; [Drug: ketoconazole]; or [Drug: rifampin] use [Temporal: within 7 days of enrollment]